降血脂藥Ezetimibe可抑制小腸吸收膽固醇（cholesterol），進而減少血中LDL含量。下列何者為此藥物之作用標的？
A. HMG-CoA reductase
B. apoB-100
C. transport protein NPC1L1
D. microsomal triglyceride transfer protein（MTP）

正確答案：C. transport protein NPC1L1